INR = 1.5 x ULN unless subject has known hemophilia or is stable on an anticoagulant regimen affecting INR.

The above is a clinical trial inclusion criterion. Annotated with entity spans:
[Measurement: INR] [Value: = 1.5 x ULN] [Negation: unless] subject has known [Condition: hemophilia] or is [Condition: stable on an anticoagulant regimen affecting INR].